Clinical trial exclusion criterion:
Contraindication for the use of corticosteroids or local anesthetics

Annotated entities:
- Drug: "corticosteroids"
- Drug: "local anesthetics"
- Condition: "Contraindication"